Poorly controlled diabetes (HbA1c > 9.0)

The above is a clinical trial exclusion criterion. Annotated with entity spans:
[Qualifier: Poorly controlled] [Condition: diabetes] ([Measurement: HbA1c] [Value: > 9.0])